Clinical trial exclusion criterion:
Advanced or distant metastatic stage,

Entity relations:
- Has_value("stage", "Advanced metastatic")
- OR("Advanced metastatic", "distant metastatic")